communication or cognitive deficits with mini-mental state examination, (MMSE) <24/30 (Folstein et al., 1975);

The above is a clinical trial exclusion criterion. Annotated with entity spans:
[Condition: communication] or [Condition: cognitive deficits] with [Measurement: mini-mental state examination, (MMSE)] [Value: <24/30] (Folstein et al., 1975);